Clinical trial exclusion criterion:
Has a CL prescription outside the range of the available parameters of the study lenses.

Entity relations:
- Has_qualifier("CL prescription", "outside the range of the available parameters of the study lenses")